La misión del espliceosoma es:
1. Asegurar que los RNAs de transferencia adopten la configuración de trébol.
2. Impedir que los ribosomas entren en el núcleo.
3. Realizar la poliadenilación del RNA mensajero (RNAm).
4. Degradar las proteínas defectuosas.
5. Facilitar la maduración del precursor del RNAm, ya que aproxima los puntos de corte y empalme.

Respuesta correcta: 5. Facilitar la maduración del precursor del RNAm, ya que aproxima los puntos de corte y empalme.